Clinical trial exclusion criterion:
7. Acute or chronic renal dysfunction (creatinine greater than 2.5 mg/dl or less than 150µmol/L).

Entity relations:
- Has_value("creatinine", "greater than 2.5 mg/dl")
- OR("Acute renal dysfunction", "chronic renal dysfunction")
- OR("greater than 2.5 mg/dl", "less than 150µmol/L")